Se realiza un ensayo clínico en pacientes hipertensos para valorar la efectividad de un nuevo fármaco en la reducción de aparición de insuficiencia cardiaca. El Riesgo Relativo (RR) de insuficiencia cardiaca en relación con el fármaco habitual es de 0,69 con un IC al 95% de 0,31 a 1,17. ¿Qué significan estos resultados?
1. El nuevo fármaco disminuye el riesgo de insuficiencia cardiaca de forma significativa.
2. El nuevo fármaco es muy eficaz y debería comercializarse.
3. La reducción del riesgo de insuficiencia cardiaca con el nuevo fármaco es irrelevante clínicamente.
4. No existen diferencias estadísticamente significativas entre el efecto de los fármacos estudiados.
5. El nuevo fármaco aumenta el riesgo de insuficiencia cardiaca pero de forma no significativa.

Respuesta correcta: 4. No existen diferencias estadísticamente significativas entre el efecto de los fármacos estudiados.